Subject with a penile anatomical abnormality (e.g., penile fibrosis, fractures, or Peyronie's disease) which, in the investigator's opinion, could significantly impair sexual performance. This will be based on subject's reported medical history (penile exam not required)

The above is a clinical trial exclusion criterion. Annotated with entity spans:
Subject with a [Condition: penile anatomical abnormality] (e.g., [Condition: penile fibrosis], fractures, or [Condition: Peyronie's disease)] which, [Non-representable: in the investigator's opinion], [Qualifier: could significantly impair sexual performance]. This will be based on subject's reported medical history ([Procedure: penile exam] not required)